Clinical trial exclusion criterion:
Malignant tumors other than basal cell or squamous cell carcinoma of the skin, CIN(Cervical Intraepitherial Neoplasia) and CIS(Carcinoma in situ) of the cervix, and intraepithelial carcinoma of other areas Within 5 years of consent date.

Annotated entities:
- Condition: "Malignant tumors"
- Negation: "other than"
- Condition: "basal cell carcinoma of the skin"
- Condition: "squamous cell carcinoma of the skin"
- Condition: "CIN(Cervical Intraepitherial Neoplasia)"
- Condition: "CIS(Carcinoma in situ) of the cervix"
- Condition: "intraepithelial carcinoma"
- Temporal: "Within 5 years of consent date"
- Reference_point: "consent date"